Clinical trial exclusion criterion:
Not appropriate for oral antidiabetic agent

Entity relations:
- AND("appropriate", "oral antidiabetic agent")
- Has_negation("appropriate", "Not")